胎兒頭皮腫塊（caput succedaneum）是指何而言？
A. 頭皮（scalp）和骨膜（periosteum）之間有水腫
B. 頭皮和骨膜之間有血塊
C. 骨膜和頭骨（skull）之間有水腫
D. 骨膜和頭骨之間有血塊

正確答案：A. 頭皮（scalp）和骨膜（periosteum）之間有水腫